Clinical trial exclusion criterion:
Positive urine toxicology.

Entity relations:
- Has_value("urine toxicology", "Positive")